Clinical trial exclusion criterion:
Subjects with cognitive, psychiatric, or other problems that preclude informed consent.

Entity relations:
- OR("cognitive problems", "other problems that preclude informed consent", "psychiatric problems")